Clinical trial inclusion criterion:
Age: 14-80 years

Annotated entities:
- Person: "Age"
- Value: "14-80 years"